Clinical trial inclusion criterion:
Men 18 years or older

Entity relations:
- Has_value("18 years or older", "18 years or older")